Clinical trial exclusion criterion:
participation in other clinical studies with experimental therapies at the time of enrollment and preceding 3 months

Annotated entities:
- Competing_trial: "participation in other clinical studies with experimental therapies at the time of enrollment and preceding 3 months"